Clinical trial inclusion criteria:
Aged 18 years or older, male or female.
Systolic heart failure with New York Heart Association (NYHA) class II-III.
Left ventricular ejection fraction (LVEF) less than 40% by echocardiography during screening and randomization.
SCH (TSH: upper limits of normal (ULN) -10mIU/L, and FT4 level within reference range).
Having received standard HF therapy for at least 2 weeks, having reached target dose or max tolerable dose.
Provided informed consent.

Annotated entities:
- Value: "18 years or older"
- Person: "Aged"
- Person: "male"
- Person: "female"
- Condition: "Systolic heart failure"
- Measurement: "New York Heart Association (NYHA)"
- Value: "class II-III"
- Measurement: "Left ventricular ejection fraction (LVEF)"
- Value: "less than 40%"
- Procedure: "echocardiography"
- Temporal: "during screening and randomization"
- Condition: "SCH"
- Measurement: "TSH"
- Value: "upper limits of normal (ULN) -10mIU/L"
- Measurement: "FT4 level"
- Value: "within reference range"
- Procedure: "standard HF therapy"
- Temporal: "for at least 2 weeks"
- Multiplier: "target dose"
- Multiplier: "max tolerable dose"
- Non-query-able: "Provided informed consent."